一名58歲第5期慢性腎病男性，因胸痛1小時來院求診，身體檢查血壓150/94 mmHg，脈搏每分鐘80次，呼吸每分鐘18 次，心臟聽診有明顯的心包膜摩擦音，下肢微腫，實	室檢查血鈉135 mmol/L，血鉀5.3 mmol/L，血紅素8.0 g/dL，心電圖呈廣泛性 ST-segment上升。下列何項是最根本的治療？
A. 給予kayexalate（sodium polystyrene sulfonate）降低血鉀
B. 透析（dialysis）
C. 輸血（blood transfusion）
D. 經皮冠狀動脈介入治療（percutaneous coronary intervention）

正確答案：B. 透析（dialysis）